23 歲女性，偶爾會有胸悶情形，聽診發現心臟左下側緣有一收縮期心雜音，以下敘述何者正確？
A. 在心室開始舒張（ventricular filling）之前，心房會先行收縮以利將血流打入心室
B. 在心臟之收縮與舒張週期（cardiac cycle）中，收縮期（systolic phase）較舒張期（diastolic phase）來得長
C. 心臟舒張時，主動脈及肺動脈瓣均保持開啟
D. 若二尖瓣（mitral valve）無法緊密關閉，則可能會有收縮期心雜音

正確答案：D. 若二尖瓣（mitral valve）無法緊密關閉，則可能會有收縮期心雜音